一位 18 歲少女，身高 160 公分，除了月經已停止半年外，身體並無特殊疾病，但近 1 年來體重下降到 39 公斤，已低於正常體重。個案仍一直堅持自己太胖而不斷節食或進食後自我催吐，由於身體愈來愈衰弱而被家屬送來醫院強制住院治療。當檢查其神經內分泌時，下列何種激素之分泌會增加？
A. 黃體激素（luteinizing hormone, LH）
B. 濾泡刺激素（follicle-stimulating hormone, FSH）
C. 生長激素（growth hormone, GH）
D. 甲狀腺刺激素（thyroid-stimulating hormone, TSH）

正確答案：C. 生長激素（growth hormone, GH）